5) ability to walk without assistance and without an AFO on the treadmill ≥ 30 seconds at speeds ranging from 0.2-0.8 m/s,

The above is a clinical trial inclusion criterion. Annotated with entity spans:
[Parsing_Error: 5)] [Condition: ability to walk without assistance] and [Negation: without] an [Measurement: AFO on the treadmill] [Value: ≥ 30 seconds] at [Qualifier: speeds] ranging [Value: from 0.2-0.8 m/s],